Clinical trial exclusion criterion:
skin infection in proximity of injection site

Entity relations:
- Has_qualifier("skin infection", "injection site")